Interaction of WDR5 with which gene has a critical role in pancreatic cancer?

WDR5 has been implicated in cancer for its role in the COMPASS complex and its interaction with Myc. Interaction of the oncoprotein transcription factor MYC with its chromatin cofactor WDR5 is essential for tumor maintenance. The long non-coding RNA HOTTIP enhances pancreatic cancer cell proliferation